History of bilateral severe renal artery stenosis and 7) History of angioedema related to previous ACE-inhibitor treatment or known hypersensitivity to ramipril or other ACE inhibitors.

The above is a clinical trial exclusion criterion. Annotated with entity spans:
[Temporal: History] of [Qualifier: bilateral] [Qualifier: severe] [Condition: renal artery stenosis] and 7) [Temporal: History] of [Condition: angioedema] related to [Temporal: previous] [Procedure: ACE-inhibitor treatment] or [Qualifier: known] [Condition: hypersensitivity] to [Drug: ramipril] or other [Drug: ACE inhibitors].